Any other patients judged by the investigator to be unsuitable for the trial

The above is a clinical trial exclusion criterion. Annotated with entity spans:
[Non-query-able: Any other patients judged by the investigator to be unsuitable for the trial]